Clinical trial exclusion criterion:
Niacin (must be on stable dose for ≥3 months);

Entity relations:
- Has_temporal("stable dose", "≥3 months")
- Has_qualifier("Niacin", "stable dose")